Participants with T2DM who have hypoglycemia unawareness

The above is a clinical trial exclusion criterion. Annotated with entity spans:
Participants with [Condition: T2DM] who have [Condition: hypoglycemia unawareness]